Clinical trial exclusion criterion:
Patients who are unable to give informed consent

Annotated entities:
- Observation: "unable to give informed consent"